What is SCENAR therapy used for?

localized suppurative peritonitis in the postoperative period
management of post-herpetic neuralgia
treatment of 103 patients with duodenal ulcer
treatment of neurogenic dysfunction of the bladder in children with nocturnal enuresis